History of previous Hepatitis B vaccination(s)

The above is a clinical trial exclusion criterion. Annotated with entity spans:
History of previous [Procedure: Hepatitis B vaccination](s)